Clinical trial inclusion criterion:
Concomitant use of potent CYP3A4 inhibitors (atazanavir, clarithromycin, indinavir, itraconazole, ketoconazole, nefazodone, nelfinavir, ritonavir, saquinavir, telithromycin and voriconazole) or inducers (carbamazepine, dexamethasone, phenobarbital, phenytoin, rifampin, and rifapentine)

Annotated entities:
- Drug: "potent CYP3A4 inhibitors"
- Drug: "atazanavir"
- Drug: "clarithromycin"
- Drug: "indinavir"
- Drug: "itraconazole"
- Drug: "ketoconazole"
- Drug: "nefazodone"
- Drug: "nelfinavir"
- Drug: "ritonavir"
- Drug: "saquinavir"
- Drug: "telithromycin"
- Drug: "voriconazole"
- Drug: "potent CYP3A4 inducers"
- Drug: "carbamazepine"
- Drug: "dexamethasone"
- Drug: "phenobarbital"
- Drug: "phenytoin"
- Drug: "rifampin"
- Drug: "rifapentine"
- Temporal: "Concomitant"